Clinical trial exclusion criterion:
Patients unable to give informed consent.

Annotated entities:
- Informed_consent: "Patients unable to give informed consent"